關於Achalasia之敘述，下列何者錯誤？
A. 現在的理論是支配lower esophageal sphincter之神經受損所致
B. 長時間最易引起esophageal adenocarcinoma
C. 典型症狀為吞嚥困難、食物逆流及體重減輕
D. 其外科治療主要為esophagomyotomy

正確答案：B. 長時間最易引起esophageal adenocarcinoma